Clinical trial exclusion criterion:
don't have heart disease

Annotated entities:
- Negation: "don't have"
- Condition: "heart disease"